Clinical trial inclusion criterion:
Age 18 to 70 years old

Entity relations:
- Has_value("Age", "18 to 70 years old")